Clinical trial exclusion criterion:
the history of severe inoculation allergies

Annotated entities:
- Condition: "inoculation allergies"
- Qualifier: "severe"
- Temporal: "history"